Clinical trial exclusion criterion:
Sever forms of peripheral arterial occlusive disease and Raynaud's syndrome.

Entity relations:
- Has_qualifier("peripheral arterial occlusive disease", "Sever")
- OR("peripheral arterial occlusive disease", "Raynaud's syndrome")